Clinical trial inclusion criterion:
female or male of 50 to 85 years old with a care giver

Annotated entities:
- Value: "50 to 85 years"
- Person: "old"